下列那一種荷爾蒙與受器（receptor）結合後，會啟動受器之酪胺酸激酶（tyrosine kinase）的活性？
A. epinephrine
B. glucagon
C. insulin
D. estrogen

正確答案：C. insulin